The Shingrix vaccine is used to prevent what disease?

The Shingrix vaccine is used for prevention of herpes zoster.